Central nervous system involvement.

The above is a clinical trial exclusion criterion. Annotated with entity spans:
[Condition: Central nervous system involvement].